Which enhancers are characterized as latent?

here, we describe latent enhancers, defined as regions of the genome that in terminally differentiated cells are unbound by tfs and lack the histone marks characteristic of enhancers but acquire these features in response to stimulation.